Clinical trial inclusion criterion:
8. No history of drug allergy

Entity relations:
- AND("allergy", "drug")
- Has_negation("drug", "No")